En relación con la sífilis, ¿cuál de las siguientes respuestas es correcta?:
1. Las bacterias pueden atravesar la placenta durante el embarazo produciendo sífilis congénita.
2. Para la realización de las pruebas treponémicas se emplea el antígeno cardiolipina.
3. El tratamiento de elección es doxiciclina.
4. Las pruebas treponémicas se utilizan de elección con el líquido cefalorraquídeo para diagnosticar una neurosífilis.

Respuesta correcta: 1. Las bacterias pueden atravesar la placenta durante el embarazo produciendo sífilis congénita.